Clinical trial inclusion criterion:
Level I or level II on the American Society of Anesthesiologists (ASA) physical status classification system (as determined by the anesthesiologist)

Annotated entities:
- Measurement: "American Society of Anesthesiologists (ASA) physical status"
- Value: "Level I or level II"